Clinical trial exclusion criteria:
Women with multi-fetal pregnancy, diabetes mellitus, chronic hypertension, or chronic renal disease

Annotated entities:
- Person: "Women"
- Condition: "multi-fetal pregnancy"
- Condition: "diabetes mellitus"
- Condition: "chronic hypertension"
- Condition: "chronic renal disease"